Clinical trial exclusion criteria:
Patients with placenta pathology such as praevia, acreta, pre-eclampsia
Patients with bleeding disorders including vonWillebrand disease type I.
Known intolerance to one of the two drugs.
Patients with prolonged QT-time or other serious cardiac diseases.
Liver or kidney failure.
Epilepsy.
Any medical reason why, in the opinion of the investigator, the patient should not participate

Annotated entities:
- Condition: "placenta pathology"
- Condition: "praevia"
- Condition: "acreta"
- Condition: "pre-eclampsia"
- Condition: "bleeding disorders"
- Condition: "vonWillebrand disease type I"
- Condition: "intolerance"
- Multiplier: "one of the two"
- Drug: "drugs"
- Condition: "prolonged QT-time"
- Qualifier: "other"
- Condition: "serious cardiac diseases"
- Condition: "Liver failure"
- Condition: "kidney failure"
- Condition: "Epilepsy"
- Post-eligibility: "Any medical reason why, in the opinion of the investigator, the patient should not participate"